Previous recruitment into the trial

The above is a clinical trial exclusion criterion. Annotated with entity spans:
[Competing_trial: Previous recruitment into the trial]